下列何種癌症若轉移到脊椎時，會造成骨頭增生的現象？
A. 胃癌
B. 甲狀腺癌
C. 腸癌
D. 攝護腺癌

正確答案：D. 攝護腺癌